Una voltamperometría cíclica:
1. Se fundamenta en un régimen de difusión estacionario.
2. Utiliza macroelectrodos como electrodos de trabajo.
3. Nunca necesita de un sistema potenciostático.
4. Se realiza siempre en una disolución no agitada.
5. Utiliza un formato de onda cuadrada de potencial como sistema de excitación.

Respuesta correcta: 4. Se realiza siempre en una disolución no agitada.